6. ECOG Performance Status of 0 or 1.

The above is a clinical trial inclusion criterion. Annotated with entity spans:
6. [Measurement: ECOG Performance Status] of [Value: 0 or 1].